Women who are breastfeeding, pregnant, or desiring pregnancy

The above is a clinical trial exclusion criterion. Annotated with entity spans:
[Pregnancy_considerations: Women who are breastfeeding, pregnant, or desiring pregnancy]